Clinical trial inclusion criteria:
Adults (18 and older) with physiologically confirmed SA or mild-moderate asthma and followed by an asthma specialist for at least 6 months.
Must agree to have regular clinic visits (minimum 3-4 per year for SA, 1-2 for mild-moderate asthma).
Must have good compliance with medications Patients with asthma and COPD.

Annotated entities:
- Value: "18 and older"
- Person: "Adults"
- Person: "18 and older"
- Condition: "SA"
- Condition: "asthma"
- Qualifier: "mild"
- Qualifier: "moderate"
- Observation: "followed by an asthma specialist"
- Temporal: "for at least 6 months"
- Post-eligibility: "Must agree to have regular clinic visits (minimum 3-4 per year for SA, 1-2 for mild-moderate asthma)."
- Condition: "good compliance"
- Drug: "medications"
- Condition: "asthma"
- Condition: "COPD"